下列何者不是鴉片類藥物（opioids）的作用？
A. 抗痙攣
B. 抑制咳嗽
C. 便秘
D. 瞳孔縮小

正確答案：A. 抗痙攣